Clinical trial inclusion criterion:
Major abdominal surgery

Annotated entities:
- Procedure: "Major abdominal surgery"